Onset of MS symptoms (as determined by a neurologist, either at present or retrospectively) within 10 years of the date the ICF is signed

The above is a clinical trial inclusion criterion. Annotated with entity spans:
Onset of [Condition: MS symptoms] (as determined by a neurologist, either at present or retrospectively) [Temporal: within 10 years] of the date the ICF is signed